¿Cuál de las siguientes sustancias químicas es considerada el carcinógeno individual más letal?
1. Alcohol.
2. Humo del tabaco.
3. Alquitrán.
4. Benceno.
5. Níquel.

Respuesta correcta: 2. Humo del tabaco.